Allodynia是形容疼痛的那一種感覺？
A. 沒有刺激下，也會感到異常感覺
B. 對於無害（nonnoxious）的刺激，也會感覺到疼痛
C. 對於有害（noxious）的刺激，感覺越來越強烈
D. 對於有害（noxious）的刺激，感覺越來越減弱

正確答案：B. 對於無害（nonnoxious）的刺激，也會感覺到疼痛